El cinamaldehído es un aldehído presente en:
1. Alcanfor.
2. Vainilla.
3. Aceite de almendra.
4. Aceite de jazmín.
5. Canela.

Respuesta correcta: 5. Canela.